Clinical trial exclusion criterion:
History of, or current, open head brain trauma. Candidates with any metal, shrapnel or other similar objects in the head that could affect the QEEG

Entity relations:
- Has_temporal("open head brain trauma", "History")
- AND("affect", "QEEG")
- AND("metal", "affect")
- OR("History", "current")
- OR("metal", "objects in the head", "shrapnel")